Clinical trial exclusion criterion:
The participant with laboratory data meeting any of the following:

Annotated entities:
- Parsing_Error: "The participant with laboratory data meeting any of the following:"